Clinical trial exclusion criterion:
eGFR <60 T2DM patients on insulin, GLP-1 RA or SGLT2 treatment Major organ disease type 1 diabetes

Annotated entities:
- Measurement: "eGFR"
- Value: "<60"
- Condition: "T2DM"
- Drug: "insulin"
- Drug: "GLP-1"
- Drug: "RA"
- Drug: "SGLT2"
- Condition: "Major organ disease"
- Condition: "type 1 diabetes"
- Line: "eGFR <60"
- Line: "T2DM patients on insulin, GLP-1 RA or SGLT2 treatment"
- Line: "Major organ disease"
- Line: "type 1 diabetes"